Clinical trial inclusion criterion:
presence of typical HF symptoms and signs

Entity relations:
- Has_qualifier("HF symptoms", "typical")
- Has_qualifier("HF signs", "typical")